一位 46 歲男性，因酒精性肝炎住院，個案已酒精依賴超過 20 年，每天約飲 2 瓶高梁酒，住院當時仍有酒味。住院第一天晚上抱怨入睡困難且出現手抖、冒冷汗、心悸與坐立難安，下列敘述何者正確？
A. 第一線用藥為抗精神病劑
B. 投以 benzodiazepine，但此藥非以改善睡眠為主要標的
C. 投以 non-benzodiazepine 的安眠藥以改善睡眠
D. 不得給予抗癲癇藥物 carbamazepine

正確答案：B. 投以 benzodiazepine，但此藥非以改善睡眠為主要標的